Clinical trial inclusion criterion:
OSDI < 30 points

Entity relations:
- Has_value("OSDI", "< 30 points")